有關母體子宮螺旋動脈（spiral artery），因受絨毛膜外滋養層細胞（extravillous trophoblast）侵犯改變，而成功建立子宮胎盤血循環系統，此循環系統第二波建立形成時期為妊娠：
A. 第6週
B. 第7～11週
C. 第12～16週
D. 第17週後

正確答案：C. 第12～16週